若已知國內男性抽菸盛行率為 20%，隨機抽三位男性，三位都抽菸的機率為何？
A. 0.067
B. 0.008
C. 0.6
D. 0.08

正確答案：B. 0.008